Clinical trial exclusion criteria:
Personal or family history of pancreatitis
Medullary thyroid carcinoma (MTC) or Multiple Endocrine Neoplasia Syndrome Type 2 (MEN 2)
Gastroparesis
Allergy to liraglutide or any of the active ingredients in liraglutide or other GLP-1 analogue
Weight loss drugs other than metformin
Type 1 diabetes mellitus or diabetic ketoacidosis
Known major cognitive deficit dementia, history of head trauma with loss of consciousness >30 min, history of stroke, current central nervous system (CNS) disorder such as seizures or opportunistic CNS infection
Renal insufficiency defined as creatinine clearance < 60 mL/min
Active opportunistic infections
Pregnancy or breastfeeding
Unstable cardiovascular disease with hospitalization within 1 year for acute coronary syndrome
Decompensated heart failure
Substance abuse
Active alcohol or opioid substitution therapy
Serious or unstable medical or psychological conditions that would compromise the subject's safety for successful participation

Annotated entities:
- Condition: "pancreatitis"
- Condition: "Medullary thyroid carcinoma"
- Condition: "MTC"
- Condition: "Multiple Endocrine Neoplasia Syndrome Type 2"
- Condition: "MEN 2"
- Condition: "Gastroparesis"
- Condition: "Allergy"
- Drug: "liraglutide"
- Drug: "GLP-1 analogue"
- Observation: "Weight loss"
- Negation: "other"
- Drug: "metformin"
- Condition: "Type 1 diabetes mellitus"
- Condition: "diabetic ketoacidosis"
- Condition: "dementia"
- Condition: "cognitive deficit"
- Condition: "head trauma"
- Condition: "loss of consciousness"
- Multiplier: ">30 min"
- Condition: "stroke"
- Condition: "central nervous system disorder"
- Condition: "seizures"
- Condition: "opportunistic CNS infection"
- Condition: "Renal insufficiency"
- Measurement: "creatinine clearance"
- Value: "< 60 mL/min"
- Condition: "opportunistic infections"
- Qualifier: "Active"
- Pregnancy_considerations: "Pregnancy or breastfeeding"
- Visit: "hospitalization"
- Temporal: "within 1 year"
- Condition: "acute coronary syndrome"
- Condition: "Decompensated heart failure"
- Condition: "Substance abuse"
- Procedure: "opioid substitution therapy"
- Observation: "alcohol"
- Non-query-able: "Serious or unstable medical or psychological conditions that would compromise the subject's safety for successful participation"